Person who walks on average less than 1km per day.

The above is a clinical trial exclusion criterion. Annotated with entity spans:
Person who [Observation: walks] on average l[Multiplier: ess than 1km per day].